Clinical trial inclusion criterion:
Ankle-brachial index above 0,40 or presence of palpable pulses in arteria dorsalis pedes and/or arteria tibialis posterior

Annotated entities:
- Measurement: "Ankle-brachial index"
- Value: "above 0,40"
- Condition: "palpable pulses"
- Reference_point: "arteria dorsalis pedes"
- Reference_point: "arteria tibialis posterior"